Clinical trial exclusion criterion:
motion sickness.

Annotated entities:
- Condition: "motion sickness"